¿Cuál de los siguientes fármacos posee propiedades antipsicóticas?:
1. Albendazol.
2. Anastrozol.
3. Aripiprazol.
4. Cilostazol.

Respuesta correcta: 3. Aripiprazol.